Clinical trial exclusion criterion:
1. Justification: in order to limit exposure to TMS, we will not enroll subjects who have received TMS less than two weeks ago.

Annotated entities:
- Parsing_Error: "1."
- Not_a_criteria: "Justification: in order to limit exposure to TMS, we will not enroll subjects who have received TMS less than two weeks ago."
- Parsing_Error: "Justification: in order to limit exposure to TMS, we will not enroll subjects who have received TMS less than two weeks ago."